5 歲男孩因運動時會喘且有發紺現象而求診。身體檢查，於左前胸可聽到第 2 度收縮心雜音，其胸部 X 光檢查發現肺部血流增加，且心臟形狀似"8＂字（figure of eight）。下列何者為最可能診斷？
A. 總肺靜脈回流異常（TAPVR），注入處為無名靜脈（innominate vein）
B. 總肺靜脈回流異常（TAPVR），注入處為上腔靜脈（superior vena cava）
C. 總肺靜脈回流異常（TAPVR），注入處為冠狀靜脈竇（coronary sinus）
D. Scimitar 症候群

正確答案：A. 總肺靜脈回流異常（TAPVR），注入處為無名靜脈（innominate vein）